Personal or family history of pancreatitis

The above is a clinical trial exclusion criterion. Annotated with entity spans:
Personal or family history of [Condition: pancreatitis]